下列那一種腦下腺激素負責引起排卵？
A. 泌乳素（prolactin）
B. 黃體促素（luteinizing hormone）
C. 催產素（oxytocin）
D. 甲促素（thyrotropin）

正確答案：B. 黃體促素（luteinizing hormone）